Clinical trial inclusion criterion:
Females must have been surgically sterilized (hysterectomy, bilateral oophorectomy, or bilateral salpingo-oophorectomy; proper documentation required) at least 6 months before screening, or be postmenopausal (defined as 24 consecutive months without menses before screening, with a follicle-stimulating hormone [FSH] level of > 40 IU/L at screening).

Entity relations:
- Has_index("at least 6 months before", "screening")
- Subsumes("surgically sterilized", "hysterectomy")
- Has_temporal("surgically sterilized", "at least 6 months before")
- Has_negation("menses", "without")
- Has_temporal("menses", "24 consecutive months")
- Has_index("before screening", "screening")
- Has_index("at screening", "screening")
- Has_temporal("follicle-stimulating hormone [FSH]", "at screening")
- Has_value("follicle-stimulating hormone [FSH]", "> 40 IU/L")
- Has_temporal("menses", "before screening")
- Subsumes("postmenopausal", "menses")
- AND("Females", "surgically sterilized")
- Subsumes("postmenopausal", "follicle-stimulating hormone [FSH]")
- OR("hysterectomy", "bilateral salpingo-oophorectomy", "bilateral oophorectomy")
- OR("surgically sterilized", "postmenopausal")